Las reglas de nomenclatura sistemática de la IUPAC otorgan prioridad como función principal, de entre los siguientes grupos funcionales, a:
1. Aminas.
2. Ácidos carboxílicos.
3. Nitrilos.
4. Éteres carboxílicos.
5. Aldehídos.

Respuesta correcta: 2. Ácidos carboxílicos.